1. Absence of objectionable cognitive impairment or presence of dementia of severe degree defined by CDR score > 2.0.

The above is a clinical trial exclusion criterion. Annotated with entity spans:
[Parsing_Error: 1.] [Negation: Absence] of [Subjective_judgement: objectionable] [Condition: cognitive impairment] or presence of [Condition: dementia] of [Qualifier: severe degree] defined by [Measurement: CDR score] [Value: > 2.0].